下列有關頸靜脈壓力測量的敍述，何者錯誤？
A. 通常以右外頸靜脈（external jugular vein）測量最適當
B. "a"波代表右心房收縮波型
C. "c"波代表右心室收縮後，三尖瓣關閉
D. 三尖瓣閉鎖不全會使"v"波變大

正確答案：A. 通常以右外頸靜脈（external jugular vein）測量最適當